Clinical trial exclusion criterion:
Current peripheral neuropathy of Grade ≥ 3.

Entity relations:
- Has_value("Grade", "≥ 3")
- multi("Grade ≥ 3", "Grade")
- Has_qualifier("peripheral neuropathy", "Grade ≥ 3")
- Has_temporal("peripheral neuropathy", "Current")